Una mujer acude a una consulta con hematomas, hemorragias en mucosas, trombocitopenia marcada (20.000/mm3), con estudio de coagulación normal, sin antecedentes de ingesta de fármacos, y con aumento de megacariocitos en médula ósea sin anomalías morfológicas. ¿Cuál es la sospecha diagnóstica?
1. Trombocitopenia inmune primaria.
2. Leucemia aguda.
3. Hemofilia.
4. Trombastenia de Glanzmann.
5. Púrpura de Schönlein-Henoch.

Respuesta correcta: 1. Trombocitopenia inmune primaria.